ocular surgery within the past 3 mouths

The above is a clinical trial exclusion criterion. Annotated with entity spans:
[Procedure: ocular surgery] [Temporal: within the past 3 mouths]